Clinical trial inclusion criterion:
Age = 75 years,

Entity relations:
- Has_value("Age", "= 75 years")